下列何者不是發展年齡 3 歲左右的正常行為表現？
A. 騎三輪腳踏車
B. 會畫圈圈
C. 會溜直排輪
D. 跑得很穩

正確答案：C. 會溜直排輪